臨床常見的眼疾中，下列何者在無併發症發生時不會出現紅眼睛？
A. 急性結膜炎
B. 結膜下出血
C. 急性青光眼
D. 白內障

正確答案：D. 白內障